Clinical trial inclusion criterion:
Males and females of 18 years of age or older at the time of the vaccination

Annotated entities:
- Person: "Males"
- Person: "females"
- Value: "18 years or older"
- Person: "age"
- Temporal: "at the time of the vaccination"
- Reference_point: "vaccination"
- Procedure: "vaccination"
- Grammar_Error: "and"